Clinical trial inclusion criterion:
Women are post-menopausal (defined as at least 1 year post cessation of menses) and aged = 45 and = 70 years. Males are aged = 40 years and = 70 years. Patients should have suitable veins for cannulation or repeated venipuncture.

Entity relations:
- Has_value("aged", "= 45 and = 70 years")
- Has_value("aged", "= 40 years and = 70 years")
- AND("Males", "aged")
- AND("Women", "post-menopausal")
- Has_index("as at least 1 year post cessation of menses", "cessation of menses")
- Has_temporal("Women", "as at least 1 year post cessation of menses")
- AND("Women", "aged")
- OR("Women", "Males")